Assumes primary responsibility for taking medication

The above is a clinical trial inclusion criterion. Annotated with entity spans:
[Non-query-able: Assumes primary responsibility for taking medication]